El precursor de todos lo nucleótidos pirimidínicos de la célula es la :
1. Uridina monofosfato (UMP).
2. Timidina monofosfato (TMP).
3. Citidina monofosfato (cmp).
4. Inosina monofosfato (IMP).
5. Guanidina monofosfato (GMP).

Respuesta correcta: 1. Uridina monofosfato (UMP).